Clinical trial exclusion criterion:
Predominance of central apneas and hypopneas, defined as more than 25% of all respiratory events.

Entity relations:
- Has_value("all respiratory events", "more than 25%")
- AND("Predominance", "central apneas and hypopneas")
- Subsumes("Predominance", "all respiratory events")